What is the inheritance of hypophosphatemic rickets?

Hypophosphatemic rickets are transmitted with:
1) autosomal recessive
2) autosomal dominant
3) X-linked recessive and
4) X-linked dominant inheritance.